Clinical trial exclusion criterion:
Any unstable systematic disease (including active infection, uncontrolled high blood pressure, unstable angina, onset of angina within the last 3 months, congestive heart failure, myocardial infarction within the previous 12 months, severe arrhythmia needing drug treatment, liver, kidney or metabolic disease)

Entity relations:
- Has_qualifier("systematic disease", "unstable")
- Has_temporal("onset", "within the last 3 months")
- AND("angina", "onset")
- Has_qualifier("high blood pressure", "uncontrolled")
- AND("treatment", "drug")
- AND("arrhythmia", "treatment")
- Has_qualifier("arrhythmia", "severe")
- Has_temporal("myocardial infarction", "within the previous 12 months")
- Subsumes("systematic disease", "infection")
- OR("infection", "liver disease", "metabolic disease", "arrhythmia", "myocardial infarction", "congestive heart failure", "unstable angina", "angina", "high blood pressure", "kidney disease")